下列何種因素會降低吸入性全身性麻醉劑的誘導速率？
A. 增加吸入性氣體中藥物濃度比例
B. 增加肺泡換氣速率
C. 麻醉藥物血中溶解度較高
D. 降低心輸出量

正確答案：C. 麻醉藥物血中溶解度較高